Clinical trial exclusion criterion:
Poorly controlled hypertension

Entity relations:
- Has_qualifier("hypertension", "Poorly controlled")